Clinical trial exclusion criterion:
unable to communicate in English

Annotated entities:
- Non-query-able: "unable to communicate in English"